下列何者是下呼吸道（lower respiratory tract）最常見的先天異常（the most common birth defect）？
A. 喉閉鎖（laryngeal atresia）
B. 氣管食道瘻管（tracheoesophageal fistula）
C. 喉氣管食道裂（laryngotracheoesophageal cleft）
D. 氣管狹窄（tracheal stenosis）

正確答案：B. 氣管食道瘻管（tracheoesophageal fistula）